El trastorno caracterizado por un patrón comportamental que viola los derechos básicos de los demás o las principales normas o reglas sociales propias de la edad del sujeto se denomina:
1. Trastorno por déficit de atención con hiperactividad.
2. Trastorno negativista desafiante.
3. Trastorno disocial.
4. Trastorno generalizado del desarrollo.
5. Trastorno del aprendizaje.

Respuesta correcta: 3. Trastorno disocial.